Clinical trial exclusion criterion:
Patients who can not tolerate apatinib treatment as judged by the investigator depending on the their medical history;

Entity relations:
- Has_negation("tolerate", "not")
- AND("tolerate", "apatinib")